La pérdida involuntaria de peso puede significar desnutrición, si es superior al:
1. 4% en 3 meses.
2. 5% en 1 mes.
3. 10% en 12 meses.
4. 15% en 10 meses.
5. 20% en 6 meses.

Respuesta correcta: 2. 5% en 1 mes.